Clinical trial exclusion criterion:
Subjects who have received valproic acid for treatment of epilepsy within 30 days of enrollment

Annotated entities:
- Drug: "valproic acid"
- Procedure: "treatment"
- Condition: "epilepsy"
- Temporal: "within 30 days of enrollment"
- Reference_point: "enrollment"